¿Cómo se denomina el enantiómero más activo de un fármaco quiral?:
1. Distómero.
2. Mesómero.
3. Eutómero.
4. Tautómero.

Respuesta correcta: 3. Eutómero.